Clinical trial inclusion criteria:
normotensive
forced expiratory volume in 1s : forced vital capacity ratio > 0.75
no medical history of cardiovascular and respiratory disease
not taking medications other than oral contraceptives
free from sleep apnea
body mass index less than 30 kg/m2

Annotated entities:
- Condition: "normotensive"
- Measurement: "forced expiratory volume in 1s : forced vital capacity ratio"
- Value: "> 0.75"
- Negation: "no"
- Temporal: "medical history"
- Condition: "cardiovascular disease"
- Condition: "respiratory disease"
- Negation: "not"
- Drug: "medications"
- Negation: "other than"
- Drug: "oral contraceptives"
- Negation: "free from"
- Condition: "sleep apnea"
- Measurement: "body mass index"
- Value: "less than 30 kg/m2"